Clinical trial exclusion criterion:
H. Pylori eradication within 2 months before study entry.

Entity relations:
- Has_temporal("H. Pylori eradication", "within 2 months before study entry")
- Has_index("within 2 months before study entry", "study entry")